En caso de convulsiones de tipo epiléptico, ¿cuál de estos datos nos permitiría afirmar que se trata de crisis histéricas, y no de crisis epilépticas?
1. La presencia de apnea.
2. Que el registro de EEG sea normal.
3. Que aparezcan tanto estando el individuo solo como acompañado.
4. Que aparezcan mordeduras en la lengua o lesiones por caídas.
5. Que aparezca incontinencia urinaria.

Respuesta correcta: 2. Que el registro de EEG sea normal.